Clinical trial inclusion criteria:
Patients aged greater than 18 years of age
Ability to understand and willingness to comply with the study protocol
Written informed consent
Patients meeting the Rotterdam PCOS workshop criteria for polycystic ovary syndrome, defined by oligomenorrhea or amenorrhea and at least one of the following two signs: clinical or biochemical evidence of hyperandrogenism or ultrasound finding of polycystic appearing ovaries.

Annotated entities:
- Person: "aged"
- Value: "greater than 18 years"
- Person: "age"
- Non-query-able: "Ability to understand and willingness to comply with the study protocol"
- Post-eligibility: "Ability to understand and willingness to comply with the study protocol"
- Post-eligibility: "Written informed consent"
- Non-query-able: "Written informed consent"
- Measurement: "Rotterdam PCOS workshop criteria for polycystic ovary syndrome"
- Value: "meeting"
- Condition: "oligomenorrhea"
- Condition: "amenorrhea"
- Multiplier: "at least one"
- Condition: "hyperandrogenism"
- Condition: "polycystic ovaries"
- Procedure: "ultrasound"